Endocrine disease:

The above is a clinical trial exclusion criterion. Annotated with entity spans:
[Non-representable: Endocrine disease:]